Subject is unable to perform tasks associated with study

The above is a clinical trial exclusion criterion. Annotated with entity spans:
[Post-eligibility: Subject is unable to perform tasks associated with study]